Clinical trial exclusion criterion:
refuse to enrollment

Annotated entities:
- Informed_consent: "refuse to enrollment"